Clinical trial exclusion criterion:
19. Concomitant administration of any herbal medications

Annotated entities:
- Parsing_Error: "19."
- Drug: "herbal medications"
- Temporal: "Concomitant"